Ability to understand and the willingness to sign a written informed consent document written in English that is approved by an institutional review board.

The above is a clinical trial inclusion criterion. Annotated with entity spans:
[Non-query-able: Ability to understand and the willingness to sign a written informed consent document written in English that is approved by an institutional review board.]